Clinical trial inclusion criterion:
No prior therapy

Annotated entities:
- Non-representable: "No prior therapy"